Clinical trial exclusion criterion:
19. Concurrent regular use of another leukotriene pathway inhibitor, including over-the-counter medications or herbal remedies.

Annotated entities:
- Parsing_Error: "19."
- Drug: "leukotriene pathway inhibitor"
- Qualifier: "another"
- Context_Error: "another"
- Multiplier: "regular use"
- Undefined_semantics: "over-the-counter medications or herbal remedies"
- Temporal: "Concurrent"